下列那一項眼疾，容易併發絲狀角膜炎（Filamentary keratitis）？
A. 巨大濾泡性結膜炎
B. 砂眼
C. 白內障
D. 乾眼症

正確答案：D. 乾眼症